Patients with any macular changes prior to the surgery (epiretinal membranes, age macular disease, macular edema...)

The above is a clinical trial exclusion criterion. Annotated with entity spans:
Patients with [Qualifier: any] [Condition: macular changes] [Temporal: prior to the surgery] ([Condition: epiretinal membranes], [Condition: age macular disease], [Condition: macular edema]...)